List orally bioavailable MPS1 kinase inhibitors

1 h-pyrrolo [3,2-c] pyridine, cct271850, nms-p715, 4-aminopyrazola,bos172722 and cct251455 are orally bioavailable MPS1 kinase inhibitors.